Clinical trial inclusion criterion:
Have features of severe pneumonia on admission (temperature >37.5 celsius or a history of fever at home or observed at the referring clinic, age-adjusted tachypnoea [respiratory rate>50 if <12-months; respiratory rate>40 if >12-months] with chest wall recession and/or oxygen saturation <92% in air), and consolidation on chest X-ray as diagnosed by treating clinician

Annotated entities:
- Condition: "pneumonia"
- Qualifier: "severe"
- Measurement: "temperature"
- Value: ">37.5 celsius"
- Person: "age"
- Condition: "tachypnoea"
- Measurement: "respiratory rate"
- Value: ">50"
- Value: "<12-months"
- Value: ">12-months"
- Measurement: "respiratory rate"
- Value: ">40"
- Person: "age"
- Condition: "chest wall recession"
- Measurement: "oxygen saturation"
- Value: "<92% in air"
- Condition: "consolidation"
- Procedure: "chest X-ray"